Clinical trial inclusion criterion:
150 cm of height or greater

Annotated entities:
- Person: "height"
- Value: "150 cm or greater"